一位 60 歲的女性到某健診中心接受例行健康檢查，在作完 60 公分長的乙狀結腸鏡檢查後，立刻出現腹痛及腹脹的症狀，理學檢查有下腹部壓痛的病徵，但並無反彈性壓痛。經照過腹部 X 光，發現在後腹腔（Retroperitoneum）有少量 free air，胸部 X 光檢查也出現少許縱隔腔的 free air，腹部電腦斷層掃描也看得出有少量的 retroperitoneal free air，但並無腹膜腔內之 free air。在乙狀結腸鏡檢查過程中有發現 sigmoid colon diverticulum，但並未進行任何切片檢查或息肉切除。依上述，病人最有可能發生什麼狀況？
A. Peptic ulcer perforation
B. Colon perforation
C. Diverticulitis of colon
D. Pneumatosis intestinalis

正確答案：B. Colon perforation